Clinical trial exclusion criterion:
Pervasive developmental disorder (PDD)

Entity relations:
- Subsumes("Pervasive developmental disorder", "PDD")